Clinical trial inclusion criterion:
1. PPROM with gestational age between 27 to 34 weeks

Entity relations:
- Has_value("gestational age", "between 27 to 34 weeks")
- AND("PPROM", "gestational age")